Podemos encontrar en esputo huevos de:
1. Clonorchis sinensis.
2. Paragonimus westermani.
3. Fasciola hepática.
4. Schistosoma japonicum.
5. Dicrocoelium dendriticum.

Respuesta correcta: 2. Paragonimus westermani.